Clinical trial exclusion criterion:
Severe co-morbid illness such as untreatable other malignancy and/or active infections.

Annotated entities:
- Condition: "co-morbid illness"
- Qualifier: "Severe"
- Qualifier: "untreatable"
- Qualifier: "other"
- Condition: "malignancy"
- Qualifier: "active"
- Condition: "infections"